Serum intact parathyroid hormone =600 pg/mL

The above is a clinical trial inclusion criterion. Annotated with entity spans:
[Measurement: Serum intact parathyroid hormone] [Value: =600 pg/mL]